Clinical trial inclusion criteria:
Osteonecrosis
planned decompression surgery with autologous stem cell transplant

Annotated entities:
- Condition: "Osteonecrosis"
- Procedure: "decompression surgery"
- Mood: "planned"
- Procedure: "autologous stem cell transplant"